Clinical trial inclusion criterion:
Not specified

Annotated entities:
- Non-representable: "Not specified"